Clinical trial exclusion criterion:
Known or suspected haemoglobinopathy/thalassaemia

Entity relations:
- Subsumes("haemoglobinopathy", "Known")
- OR("Known", "suspected")
- OR("haemoglobinopathy", "thalassaemia")